Patients on renal dialysis or with end-stage hepatic dysfunction

The above is a clinical trial exclusion criterion. Annotated with entity spans:
Patients on [Procedure: renal dialysis] or with [Condition: end-stage hepatic dysfunction]